Clinical trial exclusion criterion:
Selected for neuraxial anesthesia rather than general anesthesia for the open reduction surgery

Annotated entities:
- Procedure: "neuraxial anesthesia"
- Procedure: "general anesthesia"
- Negation: "rather than"
- Procedure: "open reduction surgery"